Do origins of replication close to yeast centromeres fire early or late?

In yeast each centromere is associated with a replication origin that is the first to fire on its respective chromosome.